Focal seizures with preserved level of consciousness

The above is a clinical trial exclusion criterion. Annotated with entity spans:
[Condition: Focal seizures] with [Condition: preserved level of consciousness]